Clinical trial inclusion criteria:
NA

Annotated entities:
- Non-query-able: "NA"